HBsAg negative at baseline

The above is a clinical trial exclusion criterion. Annotated with entity spans:
[Condition: HBsAg negative] [Temporal: at baseline]